Clinical trial exclusion criterion:
Participation in drug or devices investigative clinical trials in the last 30 days;

Annotated entities:
- Non-query-able: "Participation in drug or devices investigative clinical trials in the last 30 days;"